在脊髓損傷中，下列何種反射動作的恢復，代表脊髓休克（spinal shock）的階段已過去？
A. 膝反射
B. 踝反射
C. 頷反射（jaw jerk）
D. 球海綿體肌反射（bulbocavernosus reflex）

正確答案：D. 球海綿體肌反射（bulbocavernosus reflex）